Clinical trial inclusion criterion:
Diagnosis of moderate erectile dysfunction (defined according to the NIH Consensus Development Panel on Impotence) for more than 6 months and demonstrating and incomplete response to tadalafil alone

Entity relations:
- Has_qualifier("erectile dysfunction", "moderate")
- Has_temporal("erectile dysfunction", "for more than 6 months")
- Has_qualifier("response", "incomplete")
- AND("response", "tadalafil")